Clinical trial inclusion criterion:
primigravida, singleton pregnancy, maternal age 18-35 years, and pregnancy duration 16-20 weeks at the time of study inclusion.

Annotated entities:
- Condition: "primigravida"
- Condition: "singleton pregnancy"
- Person: "maternal age"
- Value: "18-35 years"
- Measurement: "pregnancy duration"
- Value: "16-20 weeks"
- Temporal: "at the time of study inclusion"